coronary artery disease

The above is a clinical trial exclusion criterion. Annotated with entity spans:
[Condition: coronary artery disease]